2歲的小朋友，昨晚飯後跑動玩耍時突然持續咳嗽，今天到急診，發現呼吸聲音變得明顯，聽診有單側喘息 音（Wheezing），給與短效型支氣管擴張劑（Bronchodilator）後，喘息音沒有改變，下列何者為最可能之診斷？
A. 上呼吸道感染（Upper respiratory tract infection）
B. 細支氣管炎（Bronchiolitis）
C. 氣喘（Asthma）
D. 氣道異物阻塞（Airway foreign body obstruction）

正確答案：D. 氣道異物阻塞（Airway foreign body obstruction）